Kyrgyz ethnicity

The above is a clinical trial inclusion criterion. Annotated with entity spans:
[Person: Kyrgyz ethnicity]